chronic pain condition

The above is a clinical trial exclusion criterion. Annotated with entity spans:
[Condition: chronic pain condition]